9. Patients with clinically significant medical conditions as determined by the investigator including renal, hepatic, hematologic, neurologic or immune disease. Examples include but are not limited to:

The above is a clinical trial exclusion criterion. Annotated with entity spans:
[Parsing_Error: 9.] Patients with [Qualifier: clinically significant] [Condition: medical conditions] [Observation: as determined by the investigator] including [Condition: renal], [Condition: hepatic], [Condition: hematologic], [Condition: neurologic] or [Condition: immune disease]. [Parsing_Error: Examples include but are not limited to:]